What is Desomorphine?

Desomorphine is an opioid drug which is often synthsised using a combination of readily available ingredients and is often available on the "street" as a cheaper alternative to heroin.